Peripartum bleeding

The above is a clinical trial exclusion criterion. Annotated with entity spans:
[Condition: Peripartum bleeding]